Clinical trial exclusion criterion:
Histology other than glandular neoplasia,

Annotated entities:
- Procedure: "Histology"
- Condition: "glandular neoplasia"
- Qualifier: "other than"